Has or is suspected of having a family or personal history of malignant hyperthermia.

The above is a clinical trial exclusion criterion. Annotated with entity spans:
Has or is suspected of having a [Observation: family] or [Temporal: personal history] of [Condition: malignant hyperthermia].